What are acoustic reported genes used to detect?

Acoustic reporter genes are genetic constructs that allow bacterial gene expression to be visualized in vivo using ultrasound.